Señale el enunciado correcto sobre la técnica de relajación:
1. La visualización disminuye el grado de relajación.
2. La mejor relajación se consigue cuando la persona se duerme.
3. Se puede practicar relajación, tras la práctica continuada, en cualquier posición y lugar.
4. En las respiraciones profundas no se aconseja retener el aire unos segundos.
5. Si aparece hormigueo indica que no se está relajando bien la persona.

Respuesta correcta: 3. Se puede practicar relajación, tras la práctica continuada, en cualquier posición y lugar.